有關僵直性脊椎炎（ankylosing spondylitis），下列敘述何者正確？
A. HLA-B27陰性就不是僵直性脊椎炎
B. 結膜炎是僵直性脊椎炎常見的眼睛表現
C. 僵直性脊椎炎病人大多數是HLA-B27陽性
D. 僵直性脊椎炎病人女性比較多

正確答案：C. 僵直性脊椎炎病人大多數是HLA-B27陽性